Clinical trial inclusion criterion:
Patients with chronic heart failure of New York Heart Association Class II or III, a left ventricular ejection fraction of = 40% for patients in NYHA class II or = 45% for patients in NYHA class III, a hemoglobin level at the screening visit between 9.5-13.5 g/dl, and iron deficiency, which is defined as serum ferritin level < 100µg/l or between 100 and 299 µg/l, when transferring saturation is < 20%.

Entity relations:
- Has_value("New York Heart Association", "Class II or III")
- AND("chronic heart failure", "New York Heart Association")
- Has_value("NYHA", "class II")
- Has_value("NYHA", "class III")
- Has_value("NYHA", "= 45%")
- Has_value("NYHA", "= 40%")
- AND("left ventricular ejection fraction", "NYHA")
- Has_index("at the screening visit", "the screening visit")
- Has_value("hemoglobin level", "between 9.5-13.5 g/dl")
- Has_temporal("hemoglobin level", "at the screening visit")
- Has_value("serum ferritin level", "< 100µg/l")
- Has_value("transferring saturation", "< 20%")
- Subsumes("iron deficiency", "serum ferritin level")
- Subsumes("iron deficiency", "transferring saturation")
- OR("NYHA", "NYHA")
- OR("< 100µg/l", "between 100 and 299 µg/l")